Clinical trial exclusion criterion:
Life expectancy <12 months based on investigator's judgement

Entity relations:
- Has_value("Life expectancy", "<12 months")